¿Qué mide el detector amperométrico en cromatografía de líquidos de alta resolución (HPLC)?
1. Diferencia de potencial.
2. Conductividad eléctrica.
3. Conductividad térmica.
4. Resistencia eléctrica.
5. Intensidad de corriente eléctrica.

Respuesta correcta: 5. Intensidad de corriente eléctrica.